Clinical trial exclusion criterion:
psychiatric conditions such as schizophrenia, adult ADHD, or bipolar disorder

Entity relations:
- Subsumes("psychiatric conditions", "schizophrenia")
- OR("schizophrenia", "adult ADHD", "bipolar disorder")